Clinical trial exclusion criterion:
Class III congestive heart failure

Entity relations:
- Has_qualifier("congestive heart failure", "Class III")